What is a J pouch?

After a proctocolectomy or surgery for ulcerative colitis or rectal carcinoma, a  ileal J-pouch anal anastomosis (IPAA) or J pouch. Formation of a colonic J-pouch with anastomosis to the rectal stump is an accepted form of reconstruction after low anterior resection (LAR).